Clinical trial exclusion criterion:
Patients who can't come back to clinic for follow-up on schedule.

Annotated entities:
- Post-eligibility: "Patients who can't come back to clinic for follow-up on schedule"